Clinical trial exclusion criterion:
Active bleeding

Annotated entities:
- Condition: "Active bleeding"